Clinical trial inclusion criterion:
Patient has provided signed informed consent

Annotated entities:
- Observation: "signed informed consent"